Clinical trial exclusion criterion:
Concurrent participation in any other clinical trial without written agreement of the two study teams

Annotated entities:
- Competing_trial: "Concurrent participation in any other clinical trial without written agreement of the two study teams"